Clinical trial exclusion criterion:
Allergy to opioids

Annotated entities:
- Condition: "Allergy"
- Drug: "opioids"